Clinical trial exclusion criterion:
Body Mass Index =39.9 kg/m2

Entity relations:
- Has_value("Body Mass Index", "=39.9 kg/m2")